一位65歲女性，子宮頸腫瘤大小約5公分，切片證實為	狀上皮細胞癌，內診發現骨盆腔組織變硬，攝影檢查顯示輸尿管水腫現象，病人也有坐骨神經痛情形，但一連串之檢查並未發現骨盆腔外轉移之情形，下列何者治療較恰當？
A. radical hysterectomy+ pelvic lymph node dissection
B. pelvic exenteration
C. concurrent chemoradiation therapy（CCRT）
D. debulking surgry

正確答案：C. concurrent chemoradiation therapy（CCRT）